Clinical trial exclusion criterion:
Palliative indication due to reasons other than surgical candidate status

Annotated entities:
- Non-query-able: "Palliative indication due to reasons other than surgical candidate status"